一位 60 歲女性，因急性腹痛入急診就醫。主訴陣發性腹痛自 4 天前就開始，吃東西後會加重，有輕微噁心感，排便習慣無改變。1 天前腹痛加劇且持續，伴隨輕微發燒，體溫為 37.9℃。理學檢查發現右上腹以及上腹（epigastric）壓痛，無反彈痛（rebounding pain）。血液檢查發現白血球為 18000/mm3，血色素為 13.4 g/dL，AST 為 55 U/L，ALT 為 60 U/L，Total bilirubin 為 6.5 mg/dL，Amylase 為 256 U/L， C-reactive protein（CRP）為 5.8 mg/dL。你認為下列何者最能幫助進一步的鑑別診斷？
A. 理學檢查有無 Murphy's sign
B. 直接型膽紅素（Direct bilirubin）
C. 腹部 X 光（KUB）
D. 超音波（sonography）

正確答案：D. 超音波（sonography）